Clinical trial exclusion criterion:
Poorly controlled diabetes (HbA1c > 9.0)

Entity relations:
- Has_qualifier("diabetes", "Poorly controlled")
- Has_value("HbA1c", "> 9.0")
- AND("diabetes", "HbA1c")